Clinical trial inclusion criterion:
Caucasian or Non-Caucasian

Entity relations:
- OR("Caucasian", "Non-Caucasian")